有關肺泡組織，下列敘述何者錯誤？
A. 氣體或細胞產物必需藉由擴散作用（diffusion）於肺泡與微血管之間交換
B. 氣體－血液障壁由第二型肺泡細胞（type II pneumocytes）與微血管內皮細胞及它們的基底層
C. 有些肺泡細胞與微血管內皮細胞的基底層（basement membrane）間有結締組織細胞與纖維
D. 灰塵細胞（dust cell）具有吞噬功能

正確答案：B. 氣體－血液障壁由第二型肺泡細胞（type II pneumocytes）與微血管內皮細胞及它們的基底層